Use of oral estrogen therapy, excluding oral contraceptive pills

The above is a clinical trial exclusion criterion. Annotated with entity spans:
Use of [Procedure: oral estrogen therapy], [Negation: excluding] [Drug: oral contraceptive pills]